一位 76 歲男性病人來院就醫，主訴 6 個月來有嚴重腹痛，主要發生在進食後 1～2 小時。因此他相當害怕進食。他的體重明顯下降，大便顏色如常，且無潛血反應。此病人的診斷最可能為下列何者？
A. Mesenteric angina
B. Diverticulosis
C. Duodenal ulcer
D. Irritable bowel syndrome

正確答案：A. Mesenteric angina